Clinical trial exclusion criteria:
micturition problems,
neurological history or
previous lower abdominal surgery with an abnormal micturition

Annotated entities:
- Condition: "micturition"
- Temporal: "neurological history"
- Procedure: "lower abdominal surgery"
- Condition: "micturition"
- Qualifier: "abnormal"